En un paciente trasplantado renal, ¿cuál de las siguientes características es la propia del rechazo renal agudo?
1. Infiltrado intersticial de linfocitos B.
2. Infiltrado preferentemente de linfocitos T en el intersticio renal y en los túbulos renales.
3. Fibrosis y atrofia tubular.
4. Glomerulonefritis proliferativa sin afectar al intersticio.
5. Presencia de anticuerpos circulantes antidonante e infartos renales.

Respuesta correcta: 2. Infiltrado preferentemente de linfocitos T en el intersticio renal y en los túbulos renales.